Clinical trial exclusion criterion:
Lack of informed consent signed,

Entity relations:
- Has_negation("informed consent signed", "Lack of")